Clinical trial exclusion criterion:
Lack of capacity or willingness to consent

Annotated entities:
- Observation: "willingness to consent"
- Negation: "Lack of"
- Observation: "capacity to consent"